下列何種病毒最常造成先天性疾病，並影響新生兒聽力與智能發展？
A. 麻疹病毒（Measles virus）
B. 單純疱疹病毒（Herpes simplex virus）
C. 巨細胞病毒（Cytomegalovirus）
D. B19細小病毒（Parvovirus B19）

正確答案：C. 巨細胞病毒（Cytomegalovirus）